Clinical conditions.

The above is a clinical trial exclusion criterion. Annotated with entity spans:
[Non-representable: Clinical conditions.]